El Óxido Nítrico (NO) se sintetiza a partir del aminoácido:
1. Arginina.
2. Asparagina.
3. Alanina.
4. Aspartato.
5. Valina.

Respuesta correcta: 1. Arginina.